Clinical trial exclusion criterion:
Life expectancy <1 year due to comorbidity

Entity relations:
- Has_value("Life expectancy", "<1 year")
- AND("Life expectancy", "comorbidity")